檸檬酸循環（Citric acid cycle）中那個酵素可催化 FADH2 的產生？
A. 異檸檬酸脫氫酶（Isocitrate dehydrogenase）
B. 蘋果酸脫氫酶（Malate dehydrogenase）
C. α-酮戊二酸脫氫酶（α-Ketoglutarate dehydrogenase）
D. 琥珀酸脫氫酶（Succinate dehydrogenase）

正確答案：D. 琥珀酸脫氫酶（Succinate dehydrogenase）